Clinical trial exclusion criterion:
Subject with hereditary degenerative retinal disorders such as retinitis pigmentosa

Entity relations:
- Subsumes("hereditary degenerative retinal disorders", "retinitis pigmentosa")